Patients who have received the last administration of an anticancer therapy including chemotherapy, immunotherapy, hormonal therapy and monoclonal antibodies </= 2 weeks prior to starting the study drug, or who have not recovered from the side effects of such therapy

The above is a clinical trial exclusion criterion. Annotated with entity spans:
Patients who have received the last administration of an [Procedure: anticancer therapy] including [Procedure: chemotherapy], [Procedure: immunotherapy], [Procedure: hormonal therapy] and [Drug: monoclonal antibodies] [Temporal: </= 2 weeks prior to starting the study drug], or who have not [Condition: recovered from the side effects of such therapy]